下列病人需要接受二尖瓣膜置換手術，何者建議使用生物組織瓣膜（bioprosthetic tissue valve）？
A. 18歲的年輕人
B. 40歲病人合併長期規則洗腎以及高血鈣症
C. 40歲病人合併慢性心房震顫且長期規則服用抗凝血劑
D. 70歲病人合併慢性肺氣腫

正確答案：D. 70歲病人合併慢性肺氣腫